下列何種藥物，不會增加細胞中的cyclic GMP含量？
A. isoproterenol
B. sodium nitroprusside
C. sildenafil
D. atrial natriuretic peptide

正確答案：A. isoproterenol